Metabolic Syndrome (ATP III)

The above is a clinical trial inclusion criterion. Annotated with entity spans:
[Condition: Metabolic Syndrome] ([Measurement: ATP] [Value: III])